小玲因肥胖掛李醫師門診尋求治療，李醫師建議她開始記錄每天飲食種類及量，隔週再回診。李醫師的處置屬於認知行為治療的那一項？
A. 自我監督
B. 解決問題
C. 刺激控制
D. 認知重建

正確答案：A. 自我監督